Clinical trial inclusion criterion:
Children that the nurse evaluates to die within the next 24 hours.

Annotated entities:
- Non-query-able: "Children that the nurse evaluates to die within the next 24 hours."